In good general health based on medical history and physical exam

The above is a clinical trial inclusion criterion. Annotated with entity spans:
In [Condition: good general health] based on [Temporal: medical history] and [Procedure: physical exam]